Age 10-55 years

The above is a clinical trial inclusion criterion. Annotated with entity spans:
[Person: Age] [Value: 10-55 years]